篩檢自體免疫疾病最有用的實驗室檢查為下列那一種？
A. C-反應蛋白（C-reactive protein）
B. 尿酸（uric acid）
C. 免疫球蛋白 M（immunoglobulin M）
D. 抗核抗體（anti-nuclear antibodies）

正確答案：D. 抗核抗體（anti-nuclear antibodies）